Significant congenital anomaly or medical problem that in the opinion of the investigator would preclude enrollment in this study.

The above is a clinical trial exclusion criterion. Annotated with entity spans:
[Non-representable: Significant congenital anomaly or medical problem that in the opinion of the investigator would preclude enrollment in this study].